Clinical trial exclusion criterion:
2. For subjects in Cohort B: previous therapy for more than 48 hours with any parenteral antibiotic with activity against MRSA, except vancomycin and/or daptomycin, within 72 hours of positive blood culture results confirming persistence.

Annotated entities:
- Observation: "Cohort B"
- Non-query-able: "Cohort B"
- Temporal: "previous"
- Procedure: "therapy"
- Undefined_semantics: "therapy"
- Temporal: "for more than 48 hours"
- Drug: "parenteral antibiotic with activity against MRSA"
- Qualifier: "parenteral"
- Qualifier: "with activity against MRSA"
- Observation: "MRSA"
- Drug: "vancomycin"
- Negation: "except"
- Drug: "daptomycin"
- Temporal: "within 72 hours of positive blood culture results"
- Reference_point: "positive blood culture results"
- Value: "positive results"
- Procedure: "blood culture"